Clinical trial inclusion criterion:
The patient or guardian agrees to the study protocol and the schedule of clinical and dynamic SPECT follow-up, and provides informed, written consent, as approved by the appropriate Institutional Review Board/Ethical Committee of the respective clinical site.

Annotated entities:
- Informed_consent: "informed, written consent"